Explain amniotic band syndrome.

Amniotic band syndrome, also known as constriction ring syndrome, happens when fibrous bands of the amniotic sac (the lining inside the uterus that contains a fetus) get tangled around a developing fetus. In rare cases, the bands wrap around the fetus' head or umbilical cord.